Clinical trial inclusion criteria:
Patients must be more than 18 years of age and referred for coronary angiography

Annotated entities:
- Value: "more than 18 years"
- Person: "age"
- Procedure: "coronary angiography"
- Mood: "referred for"